Pregnancy or lactation

The above is a clinical trial exclusion criterion. Annotated with entity spans:
[Condition: Pregnancy] or [Condition: lactation]